Adult patient under guardianship with consent obtained and the legal guardian's authorisation obtained.

The above is a clinical trial inclusion criterion. Annotated with entity spans:
[Informed_consent: Adult patient under guardianship with consent obtained and the legal guardian's authorisation obtained].